Invasive hepatocellular carcinoma without any isolated tumor

The above is a clinical trial exclusion criterion. Annotated with entity spans:
[Qualifier: Invasive] [Condition: hepatocellular carcinoma] [Negation: without] any [Condition: isolated tumor]